What percentage of patients of nasopharyngeal carcinoma (NPC) develop recurrent disease?

The overall recurrence rate was 75% in HPV negative patients and 11% in HPV positive ones. Disease recurred in a spared parotid gland in three patients (1.04%).